Treatment with cholestyramine or colestipol

The above is a clinical trial exclusion criterion. Annotated with entity spans:
[Procedure: Treatment] with [Drug: cholestyramine] or [Drug: colestipol]